Provide written informed consent.

The above is a clinical trial inclusion criterion. Annotated with entity spans:
[Post-eligibility: Provide written informed consent].